Clinical trial exclusion criterion:
Any contradiction to Bisoprolol according to label, including:

Entity relations:
- AND("contradiction", "Bisoprolol")